下列有關性病以及 genital ulcer 的敘述，何者錯誤？
A. 梅毒（Syphilis）治療的首選藥物是 Penicillin
B. Haemophilus ducreyi 是引起 Chancroid 的致病菌，ulcer 部位的疼痛明顯
C. Herpes 引起的病灶常是多發性的小水泡
D. 梅毒病人在治療後，血中的 TPHA 可作為治療反應的參考依據

正確答案：D. 梅毒病人在治療後，血中的 TPHA 可作為治療反應的參考依據